Clinical trial inclusion criterion:
Non-smoking

Entity relations:
- Has_negation("smoking", "Non")